Clinical trial exclusion criterion:
Having commenced anti-viral treatment against hepatitis C, B within the past 1 month

Entity relations:
- AND("anti-viral treatment", "hepatitis C")
- Has_temporal("anti-viral treatment", "past 1 month")
- OR("hepatitis C", "hepatitis B")